Clinical trial exclusion criterion:
ventral hernia repair

Entity relations:
- AND("repair", "ventral hernia")